Clinical trial exclusion criterion:
Prior diagnosis of a class IV cardiovascular disease (according to the New York Heart Association, 1964), hypothyroidism, diabetes mellitus, chronic kidney disease (С3-5), or disease of liver with portal hypertension and/or severe decompensation (Child-Pugh score > 6).

Annotated entities:
- Condition: "cardiovascular disease"
- Measurement: "New York Heart Association"
- Value: "class IV"
- Condition: "hypothyroidism"
- Condition: "diabetes mellitus"
- Condition: "chronic kidney disease"
- Measurement: "С"
- Value: "3-5"
- Condition: "disease of liver"
- Condition: "portal hypertension"
- Condition: "severe decompensation"
- Measurement: "Child-Pugh score"
- Value: "> 6"